Clinical trial exclusion criterion:
Need for 10% glucose solution

Entity relations:
- Has_mood("10% glucose solution", "Need for")